下列那一種 autoimmune disease 最常見於第一型糖尿病（type 1 diabetes mellitus）病童？
A. Chronic lymphocytic thyroiditis
B. Celiac disease
C. Atrophic gastritis
D. Addison disease

正確答案：A. Chronic lymphocytic thyroiditis